Need for long-term oral anticoagulation;

The above is a clinical trial exclusion criterion. Annotated with entity spans:
[Mood: Need for] [Procedure: long-term oral anticoagulation];